Describe the Java Adverse Drug Event (JADE) tool

The Java Adverse Drug event (Jade) is a tool for medical researchers to explore adverse drug events using health insurance plans and drug-drug interactions.